Women who are less than 6 weeks postpartum

The above is a clinical trial exclusion criterion. Annotated with entity spans:
[Person: Women] who are [Temporal: less than 6 weeks postpartum]